Clinical trial exclusion criterion:
Subjects taking fish oil or any other supplements, which in the investigator s opinion may interfere with the study.

Annotated entities:
- Drug: "fish oil"
- Subjective_judgement: "Subjects taking fish oil or any other supplements, which in the investigator s opinion may interfere with the study."
- Post-eligibility: "Subjects taking fish oil or any other supplements, which in the investigator s opinion may interfere with the study."